Clinical trial exclusion criterion:
In-ability to postpone anti-coagulation medications.

Entity relations:
- Has_mood("anti-coagulation medications", "In-ability to postpone")